Clinical trial inclusion criteria:
Currently Homeless
Smoked at least 100 cigarettes in lifetime
AUDIT score of > or equal to 5, < or equal to 26
Aged 18 years or older
Willing to attend study sessions and follow other study protocol

Annotated entities:
- Person: "Homeless"
- Observation: "Smoked"
- Multiplier: "at least 100 cigarettes"
- Measurement: "AUDIT"
- Value: "score of > or equal to 5, < or equal to 26"
- Person: "Aged"
- Value: "18 years or older"
- Post-eligibility: "Willing to attend study sessions and follow other study protocol"